Incarceration

The above is a clinical trial exclusion criterion. Annotated with entity spans:
[Person: Incarceration]